Name 4 circular RNA molecules associated with carcinogenesis.

circ-ABCB10 knockdown suppressed the proliferation and increased apoptosis of breast cancer cells.
Hsa_circ_0058246 was elevated in tumor specimens of patients with poor clinical outcomes.
Circ-FBXW7 expression positively associated with glioblastoma patient overall survival.
ciRS-7 promotes the development of cancer by acting as sponge of miR-7.